What are there sex differences in SAMHD1 activity?

The host restriction factor SAMHD1 exists in a hyperphosphorylated, less active state in male-derived macrophages. SAMHD1 is an essential modulator of infectivity in a sex-dependent manner in macrophages, constituting a novel component of sex differences in innate immune control of HIV-1.